一位 35 歲男性病人接受超音波檢查，下列何種情況會有正常大小的脾臟？
A. 溶血性貧血（Hemolytic anemia）
B. 巨結節性肝硬化（Macronodular cirrhosis）
C. 鐮狀細胞貧血（Sickle cell anemia）
D. 原發生血小板缺乏性紫斑（Idiopathic thrombocytopenic purpura）

正確答案：D. 原發生血小板缺乏性紫斑（Idiopathic thrombocytopenic purpura）